Clinical trial inclusion criterion:
HbA1c between 7.1% and 11.0%, inclusive.

Entity relations:
- Has_value("HbA1c", "between 7.1% and 11.0%, inclusive")